Polymerase chain reaction（PCR）在臨床診斷上是一個很重要的工具，在一般反應過程不需要下列何項？
A. 大量純化的 DNA
B. 溫控循環儀
C. 四種去氧核糖核酸
D. 對熱穩定的 DNA polymerase

正確答案：A. 大量純化的 DNA